Clinical trial exclusion criterion:
Renal failure / patients undergoing dialysis

Annotated entities:
- Condition: "Renal failure"
- Procedure: "dialysis"